Fasting TG<500mg/dL

The above is a clinical trial inclusion criterion. Annotated with entity spans:
[Measurement: Fasting TG][Value: <500mg/dL]